供應及支配下肢內收肌群（adductor muscles）的血管與神經，分別是：
A. 閉孔動脈（obturator artery）與閉孔神經（obturator nerve）
B. 閉孔動脈（obturator artery）與股神經（femoral nerve）
C. 深股動脈（deep femoral artery）與閉孔神經（obturator nerve）
D. 深股動脈（deep femoral artery）與股神經（femoral nerve）

正確答案：C. 深股動脈（deep femoral artery）與閉孔神經（obturator nerve）